Current diagnosis of bipolar disorder or schizophrenia on structured interview (MINI Plus)

The above is a clinical trial inclusion criterion. Annotated with entity spans:
Current diagnosis of [Condition: bipolar disorder] or [Condition: schizophrenia] on [Measurement: structured interview] ([Measurement: MINI Plus])